下列抗結核藥物的常見副作用之敘述，何者錯誤？
A. Isoniazid 會引起 peripheral neuritis
B. Ethambutol 會引起 optic neuritis
C. Rifampin 會引起尿酸過高
D. Pyrazinamide 會引起肝炎

正確答案：C. Rifampin 會引起尿酸過高